Have been smoking for at least one year

The above is a clinical trial inclusion criterion. Annotated with entity spans:
Have been [Observation: smoking] for [Temporal: at least one year]